Clinical trial exclusion criterion:
Radiofrequency treatment history,

Annotated entities:
- Procedure: "Radiofrequency treatment"
- Temporal: "history"